El material genético de los parvovirus es:
1. DNA de doble cadena.
2. DNA de cadena sencilla.
3. RNA de cadena simple positiva.
4. RNA de cadena simple negativa.
5. RNA de doble cadena.

Respuesta correcta: 2. DNA de cadena sencilla.